Clinical trial inclusion criterion:
Subjects must weigh at least 110 pounds (50 kg), but not to present obesity (BMI < 32kg/m2).

Annotated entities:
- Measurement: "weigh"
- Value: "at least 110 pounds"
- Value: "at least 50 kg"
- Condition: "obesity"
- Measurement: "BMI"
- Negation: "not to present"
- Value: "< 32kg/m2"